關於乾癬（psoriasis）的敘述，下列何者正確？
A. 白種人罹患乾癬的比例比華人低
B. Köebner phenomenon只見於這個疾病
C. 部分患者會有家族史
D. 不會造成指甲及關節病變

正確答案：C. 部分患者會有家族史